Sostienen y nutren las células germinales masculinas las células de:
1. Leydig.
2. Merkel.
3. Sertoli.
4. Langerhans.

Respuesta correcta: 3. Sertoli.